Is not a habitual wearer of Avaira sphere lenses

The above is a clinical trial exclusion criterion. Annotated with entity spans:
Is not a habitual wearer of [Device: Avaira sphere lenses]